Clinical trial inclusion criterion:
4. Viable, granulating wound (investigator discretion)

Annotated entities:
- Parsing_Error: "4."
- Qualifier: "Viable"
- Qualifier: "granulating"
- Condition: "wound"
- Subjective_judgement: "investigator discretion"